下列那一種全身麻醉劑（general anesthetics）最容易造成心輸出量及血壓下降？
A. ketamine
B. halothane
C. nitrous oxide
D. isoflurane

正確答案：B. halothane